Clinical trial exclusion criterion:
Subjects with abnormal estimated glomerular filtration rate (eGFR).

Entity relations:
- Has_value("estimated glomerular filtration rate (eGFR)", "abnormal")